HER-2 belongs to what family of proteins?

Her-2 belongs to the family of the human epidermal growth factor receptors (EGFRs).